Clinical trial exclusion criterion:
Primary language spoken that is not English or Spanish

Annotated entities:
- Non-query-able: "Primary language spoken that is not English or Spanish"